一位 70 歲胃癌男性因為突然下半身癱瘓（paraplegia）來急診就醫。發病前一個月開始出現下背痛。 X 光檢查發現第一腰椎產生病理性骨折（pathological fracture），並產生脊髓壓迫（spinal cord compression）。血液檢查 alkaline phosphatase 780 U/L，calcium 3.8 mmol/L。下列敘述何者錯誤？
A. 轉移性癌症引起之脊髓壓迫，可使用大劑量類固醇及放射線治療
B. 愈早開始進行治療，則日後病患之神經學症狀能改善的機會也愈大
C. 高血鈣症（hypercalcemia）之治療，包括限制水分攝取、使用利尿劑及 bisphosphonate 類藥物
D. 腫瘤指標如 CEA（carcinoembryonic antigen）、PSA（prostate specific antigen）可以幫助鑑別診斷

正確答案：C. 高血鈣症（hypercalcemia）之治療，包括限制水分攝取、使用利尿劑及 bisphosphonate 類藥物